Clinical trial exclusion criterion:
Strong inducers of CYP 3A4

Annotated entities:
- Drug: "inducers of CYP 3A4"
- Qualifier: "Strong"